Clinical trial inclusion criterion:
Chronic intake of CNS active drugs

Annotated entities:
- Multiplier: "Chronic intake"
- Drug: "CNS active drugs"